Women who are breastfeeding

The above is a clinical trial exclusion criterion. Annotated with entity spans:
[Person: Women] who are [Observation: breastfeeding]